Al realizar una prueba diagnóstica, ¿cuáles de las siguientes opciones no es una característica probabilística?:
1. Sensibilidad.
2. Valor predictivo negativo.
3. Especificidad.
4. Límites patológicos.

Respuesta correcta: 4. Límites patológicos.